Clinical trial inclusion criterion:
Are willing to make a smoking cessation attempt

Annotated entities:
- Post-eligibility: "Are willing to make a smoking cessation attempt"